Clinical trial exclusion criteria:
Exclusion Criteria patients: Substance abuse on a daily basis during the last 3 month or patients fulfilling the criteria of ongoing substance abuse due to ICD-10/DSM-IV/V, Treatment with antidepressant during the last 30 days, Head injury with more than 5 minutes of unconsciousness, Patients involuntarily admitted or treated, Components of metal implanted by operation, Pacemaker, Pregnancy, Severe physical illness
Exclusion criteria controls: First degree relatives with psychiatric disease, Substance abuse during the last 3 month or positive screening of drugs in urine-sample, Head injury with more than 5 minutes of unconsciousness, Components of metal implanted by operation, Pacemaker, Pregnancy, Severe physical illness

Annotated entities:
- Observation: "patients"
- Condition: "Substance abuse"
- Multiplier: "daily basis"
- Multiplier: "during the last 3 month"
- Qualifier: "ICD-10/DSM-IV/V"
- Condition: "substance abuse"
- Temporal: "ongoing"
- Drug: "antidepressant"
- Temporal: "during the last 30 days"
- Condition: "Head injury"
- Multiplier: "more than 5 minutes"
- Condition: "unconsciousness"
- Observation: "involuntarily admitted"
- Observation: "involuntarily treated"
- Device: "Components of metal"
- Device: "Pacemaker"
- Condition: "Pregnancy"
- Condition: "Severe physical illness"
- Observation: "controls"
- Observation: "First degree relatives"
- Condition: "psychiatric disease"
- Condition: "Substance abuse"
- Temporal: "during the last 3 month"
- Value: "positive"
- Procedure: "screening of drugs"
- Qualifier: "urine-sample"
- Condition: "Head injury"
- Multiplier: "more than 5 minutes"
- Condition: "unconsciousness"
- Device: "Components of metal"
- Device: "Pacemaker"
- Condition: "Pregnancy"
- Condition: "Severe physical illness"